Women of childbearing potential who are or might be pregnant at the time of study enrollment (method of assessment upon physician discretion)

The above is a clinical trial exclusion criterion. Annotated with entity spans:
[Person: Women] of [Condition: childbearing potential] who [Observation: are or might be] [Condition: pregnant] [Temporal: at the time of study enrollment] (method of assessment upon physician discretion)